下列有關流感嗜血桿菌（Haemophilus influenzae）的敘述，何者錯誤？
A. 幼兒感染後能引起腦膜炎（meningitis）
B. 其生長需要在培養基中補充加熱過的血液
C. 棲居於正常人體呼吸道的，主要是具莢膜的菌株
D. 市面上已有針對 b 血清型別的疫苗

正確答案：C. 棲居於正常人體呼吸道的，主要是具莢膜的菌株